En el túbulo colector, el péptico natriurético atrial inhibe directamente:
1. La reabsorción de agua.
2. La acción de la aldosterona.
3. La acción de la vasopresina.
4. La reabsorción del sodio.

Respuesta correcta: 4. La reabsorción del sodio.